磁振造影（MRI）在臨床運用中，對於接近大腦皮質（cortical）或是腦室（ventricle）旁的腦部梗塞，下列何種序列（sequences）可提供最高敏感度將病灶突顯出來？
A. T1-weighted imaging
B. T2-weighted imaging
C. fluid-attenuated inversion recovery（FLAIR）imaging
D. susceptibility-weighted imaging（SWI）

正確答案：C. fluid-attenuated inversion recovery（FLAIR）imaging